Clinical trial exclusion criterion:
2. Pulmonary veno-occlusive disease and/or pulmonary capillary hemangiomatosis

Entity relations:
- OR("Pulmonary veno-occlusive disease", "pulmonary capillary hemangiomatosis")